Clinical trial exclusion criterion:
Expected simultaneous participation in any other clinical trial of an investigational medicinal product.

Annotated entities:
- Non-query-able: "Expected simultaneous participation in any other clinical trial of an investigational medicinal product."